Clinical trial inclusion criterion:
No cases of fragile X syndrome in the family or blepharophimosis syndrome

Annotated entities:
- Condition: "fragile X syndrome"
- Observation: "in the family"
- Condition: "blepharophimosis syndrome"
- Negation: "No"